朱老先生患有糖尿病多年，1 年前曾發生輕微中風。一個寒冷的早上朱先生在院子做運動時突發胸痛，家人立刻送往醫院急診處，醫師診斷是心肌梗塞，在加護病房中，朱先生發生急性肺水腫，雖有插管並以呼吸器維持血氧濃度，延至晚上終因呼吸衰竭而死亡。朱先生死亡診斷書該如何開立？
A. 直接死因為呼吸衰竭，前肇病因為肺水腫，攸關直接死因之疾病為糖尿病
B. 直接死因為肺水腫，前肇病因為心肌梗塞，攸關直接死因之疾病為糖尿病
C. 直接死因為心肌梗塞，前肇病因為糖尿病，攸關直接死因之疾病為肺水腫
D. 直接死因為心肌梗塞，前肇病因為糖尿病，攸關直接死因之疾病為腦中風

正確答案：B. 直接死因為肺水腫，前肇病因為心肌梗塞，攸關直接死因之疾病為糖尿病